下列何種自體免疫抗體（autoantibody）與新生兒紅斑性狼瘡（neonatal lupus erythematosus）關聯性最高？
A. anti-histone
B. anti-Ro
C. anti-La
D. anti-Sm

正確答案：B. anti-Ro